Clinical trial inclusion criterion:
Has physician-diagnosed active nr-axSpA with disease duration <= 5 years

Annotated entities:
- Condition: "nr-axSpA"
- Qualifier: "active"
- Measurement: "disease duration"
- Value: "<= 5 years"
- Qualifier: "disease duration <= 5 years"